Clinical trial exclusion criterion:
eGFR(Epidermal growth factor receptor) < 50mL/min

Annotated entities:
- Measurement: "eGFR"
- Measurement: "Epidermal growth factor receptor"
- Value: "< 50mL/min"